Person who is pregnant.

The above is a clinical trial exclusion criterion. Annotated with entity spans:
Person who is [Condition: pregnant].